Para analizar la glanulometría de un sólido pulverulento se acude a la pipeta de Andreasen para determinar la:
1. Distribución de tamaños de las partículas.
2. Fluidez de las partículas.
3. Densidad de las partículas.
4. Forma de las partículas.

Respuesta correcta: 1. Distribución de tamaños de las partículas.